Clinical trial exclusion criterion:
Women who are pregnant or who are planning to be pregnant, or who are lactating (though the possibility in our target population should be very low)

Annotated entities:
- Pregnancy_considerations: "Women who are pregnant or who are planning to be pregnant, or who are lactating (though the possibility in our target population should be very low)"